Patients with Impaired Renal Function with a have a known estimated CrCl<30 ml/min

The above is a clinical trial exclusion criterion. Annotated with entity spans:
Patients with [Condition: Impaired Renal Function] with a have a known [Measurement: estimated CrCl][Value: <30 ml/min]